某勞工每日工作八小時，假設每一個小時之前10分 暴露於60 ppm之甲苯，後50分	則未暴露，其八小時時量平均暴露濃度為何？
A. 10 ppm
B. 15 ppm
C. 20 ppm
D. 60 ppm

正確答案：A. 10 ppm